Clinical trial inclusion criterion:
Be 19 years of age or older

Entity relations:
- Has_value("age", "19 years of age or older")